下列有關旋毛蟲（Trichinella spiralis）感染的敘述，有幾項是正確的？①食入未熟之帶蟲豬肉為人類常見的感染途徑 ②蟲體在骨骼肌發育及囊化 ③感染後最早出現的症狀為肌肉痛 ④豬為終宿主也同時為中間宿主
A. 1項
B. 2項
C. 3項
D. 4項

正確答案：C. 3項